Age less than 18 years

The above is a clinical trial exclusion criterion. Annotated with entity spans:
[Person: Age] [Value: less than 18 year]s